Treatment with methylphenidate is contraindicated in the opinion of the study physician

The above is a clinical trial exclusion criterion. Annotated with entity spans:
Treatment with [Drug: methylphenidate] is contraindicated in the opinion of the study physician